下列有關補體的敘述，何者錯誤？
A. 補體是一種蛋白質
B. 補體會參與專一性和非專一性防禦作用
C. 干擾素也是補體的一種
D. 補體可以溶解細菌的細胞膜

正確答案：C. 干擾素也是補體的一種